Clinical trial exclusion criterion:
Patients with a history (= 12 months) of acute coronary syndrome receiving dual antiplatelet therapy, or patients receiving monotherapy with aspirin.

Entity relations:
- Subsumes("history", "= 12 months")
- AND("monotherapy", "aspirin")
- Has_temporal("acute coronary syndrome", "history")
- Has_temporal("dual antiplatelet therapy", "history")
- OR("acute coronary syndrome", "monotherapy")
- OR("dual antiplatelet therapy", "monotherapy")